依據人體器官移植條例醫師摘取器官的規定，下列敘述何者錯誤？
A. 醫師自屍體摘取器官，經死者生前以書面或遺囑同意
B. 醫師自屍體摘取器官，經死者最近親屬以書面或口頭同意
C. 醫師自活體摘取器官前，應向捐贈者說明摘取器官之範圍及手術過程、可能之併發症及危險
D. 醫師施行摘取器官時，應善盡醫療及禮儀上必要之注意

正確答案：B. 醫師自屍體摘取器官，經死者最近親屬以書面或口頭同意